What is the genetic basis of the Delayed Sleep-Phase Syndrome (DSPS)?

Circadian gene mutations are also associated with circadian rhythm disorders such as familial advanced sleep phase syndrome, delayed sleep phase syndrome, and non-24-hour sleep-wake syndrome.  A possible association of human leucocyte antigen DR1 with delayed sleep phase syndrome has been reported. In human leukocyte antigen (HLA) typing, the incidence of DR1 positivity alone was significantly higher in DSPS patients than in healthy subjects. A length polymorphism in the circadian clock gene Per3 is linked to delayed sleep phase syndrome and extreme diurnal preference. The data suggest that AA-NAT could be a susceptibility gene for DSPS.